Clinical trial inclusion criterion:
Clinical diagnosis of stable plaque psoriasis with involvement of = 10% body surface area (excluding face and scalp)

Entity relations:
- Has_qualifier("plaque psoriasis", "stable")
- Has_value("body surface area", "= 10%")
- AND("plaque psoriasis", "body surface area")
- Has_negation("face", "excluding")
- AND("plaque psoriasis", "face")
- Has_negation("and", "excluding")
- v-AND("plaque psoriasis", "and")
- OR("face", "scalp")